Clinical trial exclusion criterion:
Pregnancy or nursing.

Entity relations:
- OR("Pregnancy", "nursing")